En espectroscopia el coeficiente ε:
1. Es el coeficiente de absortividad molar y es adimensional.
2. Es el coeficiente de absortividad molar y sus unidades son mol-1.L.cm-1.
3. Se conoce como rendimiento cuántico de fluorescencia y es adimensional.
4. Es el coeficiente de absortividad molar y sus unidades son mol.cm.L1.

Respuesta correcta: 2. Es el coeficiente de absortividad molar y sus unidades son mol-1.L.cm-1.